Clinical trial exclusion criterion:
Major surgery within 4 weeks

Annotated entities:
- Procedure: "surgery"
- Qualifier: "Major"
- Undefined_semantics: "Major"
- Subjective_judgement: "Major"
- Temporal: "within 4 weeks"